Clinical trial inclusion criterion:
Age 18 years or above

Annotated entities:
- Person: "Age"
- Value: "18 years or above"